Clinical trial exclusion criterion:
Need for a double kidney transplantation.

Annotated entities:
- Mood: "Need for"
- Procedure: "double kidney transplantation"